Clinical trial exclusion criterion:
Anamnestic history of hypersensitivity to the study drugs or to drugs with similar chemical structures

Entity relations:
- AND("hypersensitivity", "study drugs")
- Has_temporal("hypersensitivity", "Anamnestic history")
- OR("study drugs", "drugs with similar chemical structures")